Clinical trial exclusion criterion:
Subject with a penile anatomical abnormality (e.g., penile fibrosis, fractures, or Peyronie's disease) which, in the investigator's opinion, could significantly impair sexual performance. This will be based on subject's reported medical history (penile exam not required)

Entity relations:
- Subsumes("penile anatomical abnormality", "penile fibrosis")
- AND("could significantly impair sexual performance", "in the investigator's opinion")
- Has_qualifier("penile anatomical abnormality", "could significantly impair sexual performance")
- multi("could significantly impair sexual performance", "impair sexual performance")
- OR("penile fibrosis", "penile fractures", "Peyronie's disease)")